下列何種情感性疾患最常以光照療法（light therapy）治療？
A. 快速循環性躁鬱症
B. 季節性情感疾患
C. 產後憂鬱症
D. 精神病性憂鬱症

正確答案：B. 季節性情感疾患